En relación a clopidogrel, es falso que:
1. Está relacionado estructuralmente con las tienopiridinas.
2. Inhibe la adenilciclasa, y, por lo tanto incrementa los niveles de AMPc.
3. Posee un bajo índice de mielotoxicidad en relación a la ticlopidina.
4. Posee una acción más prolongada en relación a la ticlopidina.
5. En caso de intervención quirúrgica, se recomienda la interrupción del tratamiento al menos con una semana de antelación.

Respuesta correcta: 2. Inhibe la adenilciclasa, y, por lo tanto incrementa los niveles de AMPc.